職業疾病之診斷中，時常需要有流行病學資料的支持，在以下之流行病學資料之證據中，何者對於職業病診斷的必要性較低？
A. 必須有在暴露族群之中，某疾病比對照族群為高的事實
B. 該項工作暴露應已被證實會引起該疾病
C. 該疾病之發作或明顯惡化是在進入該工作場所之後才發生
D. 暴露者大多數會發作類似的疾病

正確答案：D. 暴露者大多數會發作類似的疾病